69 歲男性病患主訴兩個多月前開始有上臼齒鬆動，經拔除後，傷口無法癒合，最近 2 週來右側臉頰有持續性疼痛，右眼有突出及複視的現象，而且嘴巴張開困難，病人的病灶最有可能為何？
A. 鼻咽癌
B. 鼻竇癌
C. 硬顎癌
D. 鼻腔癌

正確答案：B. 鼻竇癌